下列何者與導致兒童肥胖（obesity）最無關係？
A. 基因變異
B. 種族差異
C. 飲食差異
D. 雙親教育程度

正確答案：D. 雙親教育程度